La Hemorragia Puerperal o Hemorragia Posparto se define como:
1. La pérdida sanguínea de más    de 250 ml de sangre tras un parto normal.
2. La pérdida sanguínea de más    de 150 ml de sangre tras un parto normal.
3. La pérdida sanguínea de más    de 500 ml de sangre tras un parto normal.
4. La pérdida sanguínea de más    de 450 ml de sangre tras un parto normal.

Respuesta correcta: 3. La pérdida sanguínea de más    de 500 ml de sangre tras un parto normal.